Clinical trial exclusion criterion:
Any anti-coagulation therapy (apart from rivaroxaban for second objective)

Entity relations:
- Has_negation("rivaroxaban", "apart from")